How many microorganisms are present in human normal gut?

Human gut microbiota is home to 10 to 100 trillions microorganisms.